Clinical trial inclusion criterion:
Pregnant women admitted to Women health hospital with a diagnosis of severe pre-eclampsia

Entity relations:
- Has_qualifier("pre-eclampsia", "severe")
- AND("admitted to", "Women health hospital")